Which disease is rated using the Fahn-Tolosa-Marin scale?

The Fahn-Tolosa-Marin clinical tremor rating scale is used for essential tremor.